Clinical trial exclusion criterion:
Unstable angina pectoris as judged by the investigator, clinically significant uncorrected valvular disease or left ventricular outflow obstruction, obstructive cardiomyopathy, poorly controlled fast atrial fibrillation or flutter, poorly controlled symptomatic brady- or tachyarrhythmias.

Entity relations:
- Has_qualifier("brady-", "symptomatic")
- Has_qualifier("brady-", "poorly controlled")
- Has_qualifier("fast atrial fibrillation", "poorly controlled")
- OR("brady-", "tachyarrhythmias")
- OR("fast atrial fibrillation", "fast atrial flutter")
- OR("valvular disease", "fast atrial fibrillation", "brady-", "obstructive cardiomyopathy", "left ventricular outflow obstruction")